Clinical trial inclusion criterion:
WBC >_3500/mm3, platelet count >_100,000/mm3.

Entity relations:
- Has_value("platelet count", ">_100,000/mm3")
- Has_value("WBC", ">_3500/mm3")